¿Cuál de los siguientes compuestos no es una coenzima?:
1. Biocitina.
2. Hemo.
3. Lipoato.
4. Tetrahidrofolato.

Respuesta correcta: 2. Hemo.